Las reacciones en las que la cinética no depende de la concentración de nucleofilo, son reacciones:
1. Radicalarias.
2. SN1.
3. Pericíclicas.
4. SN2.
5. Ninguna de las anteriores.

Respuesta correcta: 2. SN1.